關於導致子宮內膜過度增生之敘述，下列何者最不可能？
A. ⻑期無排卵（chronic anovulation）
B. ⻑期服用黃體素
C. ⻑期服用tamoxifen
D. 肥胖且無月經（amenorrhea）的婦女

正確答案：B. ⻑期服用黃體素